Clinical trial inclusion criterion:
No antibiotic treatment in the last 2 weeks

Annotated entities:
- Drug: "antibiotic treatment"
- Temporal: "in the last 2 weeks"
- Negation: "No"